關於chlorpromazine的敘述，下列何者錯誤？
A. 可以用來治療類精神疾病
B. 為一種dopamine受體的拮抗劑
C. 具有高度成癮性
D. 會發生姿態性低血壓

正確答案：C. 具有高度成癮性